¿Dónde está recomendada la canalización de un acceso intraóseo en un niño de 18 meses?:
1. Cara medial de la tibia, 3 centímetros por encima del maléolo tibial interno.
2. Superficie anteromedial de la tibia, 2-3 centímetros por debajo de la tuberosidad tibial.
3. Cara medial de la tibia, 3 centímetros por encima del maléolo tibial externo.
4. Superficie posteromedial de la tibia, 2-3 centímetros por debajo de la tuberosidad tibial.

Respuesta correcta: 2. Superficie anteromedial de la tibia, 2-3 centímetros por debajo de la tuberosidad tibial.